Se quiere estudiar si la Vitamina D puede incrementar la incidencia del cáncer de mama. En nuestra zona disponemos de un registro poblacional de cáncer. Para conseguir nuestro objetivo se seleccionan todas las mujeres diagnosticadas de cáncer de mama del registro que disponemos y cada uno de los casos se aparea con dos controles. ¿Qué diseño de estudio se ha escogido?
1. Estudio de cohortes prospectivo.
2. Estudio de casos y controles.
3. Estudio de casos y controles anidado.
4. Estudio de cohortes retrospectivo.
5. Estudio ecológico.

Respuesta correcta: 3. Estudio de casos y controles anidado.